history of prior colonic or rectal surgery

The above is a clinical trial exclusion criterion. Annotated with entity spans:
[Temporal: history of] [Temporal: prior] [Procedure: colonic] or [Procedure: rectal surgery]